Clinical trial inclusion criterion:
Women of childbearing potential must have a negative serum pregnancy test within 14 days prior to initiation of treatment and must not be lactating.

Annotated entities:
- Condition: "childbearing potential"
- Person: "Women"
- Measurement: "serum pregnancy test"
- Value: "negative"
- Temporal: "within 14 days prior to initiation of treatment"
- Reference_point: "initiation of treatment"
- Condition: "lactating"
- Negation: "not"